Clinical trial exclusion criterion:
Hypotension

Annotated entities:
- Condition: "Hypotension"